What does RUNX2 stand for?

Runt related factor-2